Después de que el paciente ha sufrido una crisis epiléptica, tiene riesgo de presentar:
1. Hipoxia, vómito y aspiración pulmonar.
2. Mareo, náuseas y dolor abdominal.
3. Cefalea intensa, hipotensión y rigidez.
4. Hipertensión arterial y arritmias.
5. Insomnio, apetito alterado y pérdida de energía.

Respuesta correcta: 1. Hipoxia, vómito y aspiración pulmonar.